La hemólisis en una muestra de suero interfiere en la determinación de la enzima Lactatodeshidrogenasa (LDH) debido a:
1. La liberación de adenilato ciclasa (enzima catalizador de la reacción).
2. La interferencia producida por la hemoglobina.
3. La elevada concentración de dicha enzima en el citoplasma de los eritrocitos.
4. La hemólisis no interfiere en la determinación de LDH.
5. La cantidad de lactato que se produce.

Respuesta correcta: 3. La elevada concentración de dicha enzima en el citoplasma de los eritrocitos.